下列何者是老年人造成頸部脊髓病變（cervical myelopathy）最常見的原因？
A. 脊椎腫瘤（spinal tumor）
B. 脊髓炎（myelitis）
C. 脊椎退化症（spondylosis）
D. 多發性硬化症（multiple sclerosis）

正確答案：C. 脊椎退化症（spondylosis）